下列有關粒線體 DNA 的敘述，何者錯誤？
A. 粒線體 DNA 並不位於細胞核內
B. 每一個粒線體有一個 copy 的 DNA
C. 一個細胞有多個粒線體
D. 有時細胞內的一部分粒線體有基因突變，其他的粒線體卻是正常的序列

正確答案：B. 每一個粒線體有一個 copy 的 DNA